Unable to read/understand English

The above is a clinical trial exclusion criterion. Annotated with entity spans:
[Non-query-able: Unable to read/understand English]